Clinical trial exclusion criterion:
Pregnant or breastfeeding.

Entity relations:
- OR("Pregnant", "breastfeeding")